下列何者不屬於荷爾蒙避孕藥的禁忌症？
A. 有血栓之病史或目前有血栓
B. 未控制良好之高血壓（severe hypertension）
C. 乳癌
D. 胃潰瘍

正確答案：D. 胃潰瘍